肝糖磷解酶（glycogen phosphorylase）的活性受到phosphorylase kinase及phosphorylase phosphatase的調節，下列何者是其發揮調節作用的主要方式？
A. 影響酵素蛋白質分解（protein degradation）
B. 磷酸化-去磷酸化作用（phosphorylation-dephosphorylation）
C. 異位調節作用（allosteric regulation）
D. 影響肝醣代謝酵素與調節蛋白質（regulatory protein）的結合作用

正確答案：B. 磷酸化-去磷酸化作用（phosphorylation-dephosphorylation）